Clinical trial inclusion criterion:
A MoCA score between 19 and 28 (inclusive) at screening. For those on cognitive enhancers (donepezil, rivastigmine, memantine, galantamine) a MoCA score between 19 and 29 (inclusive) at screening.

Annotated entities:
- Measurement: "MoCA score"
- Value: "between 19 and 28"
- Procedure: "cognitive enhancers"
- Drug: "donepezil"
- Drug: "rivastigmine"
- Drug: "memantine"
- Drug: "galantamine"
- Measurement: "MoCA score"
- Value: "between 19 and 29"